Clinical trial exclusion criterion:
concomitant massage

Entity relations:
- Has_temporal("massage", "concomitant")